Clinical trial exclusion criterion:
Strong inducers of CYP 3A4

Entity relations:
- Has_qualifier("inducers of CYP 3A4", "Strong")